Clinical trial inclusion criterion:
Diagnosed with Major Depressive Disorder, unipolar or bipolar depression

Entity relations:
- OR("Major Depressive Disorder", "unipolar depression", "bipolar depression")